Power Doppler score of >=10

The above is a clinical trial inclusion criterion. Annotated with entity spans:
[Measurement: Power Doppler score] of [Value: >=10]